一位 2 歲小朋友在餐廳跑步遊玩時突然劇咳，然後痛苦的坐在地上，呼吸有些喘，但神智清楚、膚色尚紅、能發聲講話，此時該如何處理？
A. 立即施與哈姆立克急救以免稍後完全阻塞
B. 立刻找ambu-bag予以人工換氣
C. 安撫小朋友，並儘快送醫
D. 趕快找粗針插進喉頭換氣

正確答案：C. 安撫小朋友，並儘快送醫